Clinical trial inclusion criterion:
Participants able and willing to comply with all aspects of the study, including a standardized, reduced calorie diet and an age appropriate, increased physical activity program

Annotated entities:
- Observation: "willing to comply"
- Observation: "able to comply"
- Observation: "reduced calorie diet"
- Qualifier: "standardized"
- Observation: "increased physical activity program"
- Qualifier: "age appropriate"